What is the FIRE (Functional Inference of Regulators of Expression) tool?

FIRE (Functional Inference of Regulators of Expression) is a tool to score both noncoding and coding SNVs based on their potential to regulate the expression levels of nearby genes.